Clinical trial exclusion criterion:
A prescription of a NOAC within 90 days prior to hospitalization or outpatient clinic visit for VTE.

Entity relations:
- AND("outpatient clinic visit", "VTE")
- multi("outpatient clinic visit", "outpatient clinic")
- multi("hospitalization", "hospitalization")
- Has_index("within 90 days prior to hospitalization or outpatient clinic visit for VTE", "hospitalization or outpatient clinic visit for VTE")
- multi("hospitalization or outpatient clinic visit for VTE", "hospitalization")
- Has_temporal("NOAC", "within 90 days prior to hospitalization or outpatient clinic visit for VTE")
- OR("hospitalization", "outpatient clinic visit")